下列關於胜肽類 （peptide） 荷爾蒙和類固醇類 （steroid） 荷爾蒙的比較，何者錯誤？
A. 前者的受體在細胞膜上，而後者在細胞內
B. 在血液中前者有攜帶蛋白（carrier protein），後者沒有攜帶蛋白
C. 前者如副甲狀腺荷爾蒙（parathyroid hormone）和細胞膜上受體結合後可產生cAMP
D. 後者和受體結合後會和DNA結合

正確答案：B. 在血液中前者有攜帶蛋白（carrier protein），後者沒有攜帶蛋白